Patient refusal

The above is a clinical trial exclusion criterion. Annotated with entity spans:
[Post-eligibility: Patient refusal]